奈格利氏小體（Negri body）是病毒的包涵體，用來診斷下列那種疾病？
A. 腮腺炎
B. 痲疹
C. 疹
D. 狂犬病

正確答案：D. 狂犬病